有關孩童食道閉鎖（esophageal atresia）之影像診斷學，下列那一項最不正確？
A. 絕不會呈現肺堅實（consolidation）之徵象
B. 鼻胃管之遠段位置有時對病變類型之診斷會有幫助
C. 腹部有可能呈現無腸氣（gasless abdomen）
D. 其併發之氣管食道廔管有時可用食道鋇劑攝影偵測

正確答案：A. 絕不會呈現肺堅實（consolidation）之徵象